Women at any age with early stage breast cancer (stage I-II) and American Society of Anesthesiologists (ASA) score of I-II.

The above is a clinical trial inclusion criterion. Annotated with entity spans:
[Person: Women] at [Person: any age] with [Value: early] [Measurement: stage] [Condition: breast cancer] ([Measurement: stage] [Value: I-II]) and [Measurement: American Society of Anesthesiologists (ASA) score] of [Value: I-II].